腎上腺素（epinephrine）是由那一種胺基酸合成？
A. 色胺酸（tryptophan）
B. 酪胺酸（tyrosine）
C. 半胱胺酸（cysteine）
D. 胱胺酸（cystine）

正確答案：B. 酪胺酸（tyrosine）